Clinical trial inclusion criterion:
Documented freedom from AF recurrence (symptomatic or asymptomatic arrhythmic recurrences lasting longer than 30 seconds) 3 months after successful cardiac ablation (AF recurrence during 3-month blanking period is excluded).

Annotated entities:
- Negation: "freedom"
- Condition: "AF recurrence"
- Condition: "arrhythmic recurrences"
- Value: "longer than 30 seconds"
- Temporal: "3 months after successful cardiac ablation"
- Reference_point: "cardiac ablation"
- Non-query-able: "AF recurrence during 3-month blanking period is excluded"